Honeymoon period 與下列何種疾病有關？
A. 腸道閉鎖
B. 先天性膽道閉鎖
C. 臍膨出
D. 先天性橫膈膜疝氣

正確答案：D. 先天性橫膈膜疝氣